Negative urine drug screening test at the time of screening

The above is a clinical trial inclusion criterion. Annotated with entity spans:
[Value: Negative] [Measurement: urine drug screening test] at the time of screening